下列何種抗癌藥物服用後會造成急性出血性膀胱炎的副作用？
A. doxorubicin
B. fluorouracil
C. vincristine
D. cyclophosphamide

正確答案：D. cyclophosphamide